Clinical trial inclusion criterion:
Inpatients having major foot and ankle surgery that will benefit from continuous popliteal sciatic nerve block with an indwelling catheter

Entity relations:
- AND("major foot and ankle surgery", "indwelling catheter")
- Has_qualifier("popliteal sciatic nerve block", "continuous")